Clinical trial inclusion criterion:
2. Has a diagnosis of WHO Group 1 PAH.

Annotated entities:
- Parsing_Error: "2."
- Measurement: "WHO Group"
- Value: "1"
- Condition: "PAH"